Clinical trial inclusion criterion:
M2 or M3 marrow on day 33

Entity relations:
- Has_temporal("M2 marrow", "on day 33")
- OR("M2 marrow", "M3 marrow")